Cuando se oxida el manganeso al aire a 1000 ºC se transforma por completo en Mn3O4. Ello se debe a que:
1. El Mn3O4 es el más volátil de todos los óxidos de manganeso.
2. El Mn3O4 no puede reaccionar más con oxígeno.
3. No existen óxidos de manganeso con mayor estado de oxidación.
4. El Mn3O4 es el más estable de todos los óxidos de manganeso.
5. El Mn3O4 forma una capa protectora que detiene la oxidación del metal.

Respuesta correcta: 4. El Mn3O4 es el más estable de todos los óxidos de manganeso.